Clinical trial exclusion criterion:
submucosal leiomyoma,

Annotated entities:
- Condition: "submucosal leiomyoma"